Acute exacerbation of bronchiectasis;

The above is a clinical trial inclusion criterion. Annotated with entity spans:
[Condition: Acute exacerbation of bronchiectasis];